What is the indication for prophylactic use of antibiotics in COPD?

In a subset of patients with severe disease and prone to developing infections prophylactic use of antibiotics may reduce number of exacerbations and improve social and health care costs.